Clinical trial inclusion criterion:
MLA(minimal luminal area)<4mm2

Entity relations:
- Subsumes("MLA", "minimal luminal area")
- Has_value("MLA", "<4mm2")